上腸繫膜淋巴結（superior mesenteric lymph nodes），最不可能引流來自下列何處的淋巴？
A. 胰脾淋巴結（pancreaticosplenic lymph node）
B. 腸繫膜淋巴結（mesenteric lymph node）
C. 中結腸腸淋巴結（middle colic lymph node）
D. 腸管旁淋巴結（juxta-intestinal lymph node）

正確答案：A. 胰脾淋巴結（pancreaticosplenic lymph node）